Patient's pregnant or breast-feeding or child-bearing potential

The above is a clinical trial exclusion criterion. Annotated with entity spans:
Patient's [Condition: pregnant] or [Condition: breast-feeding] or [Condition: child-bearing potential]